Clinical trial inclusion criterion:
5. Suffers from at least two of the symptoms in the GLIA™ Glaucoma Medication Ocular Side Effect Symptoms Questionnaire at a severity of 2 (moderate) or more.

Annotated entities:
- Parsing_Error: "5."
- Multiplier: "at least two"
- Condition: "symptoms"
- Measurement: "GLIA™ Glaucoma Medication Ocular Side Effect Symptoms Questionnaire"
- Value: "severity of 2 or more"
- Value: "moderate"